Clinical trial exclusion criterion:
Patient has known hypersensitivity to any of the components of the formulations used in the study.

Entity relations:
- Has_qualifier("hypersensitivity", "components of the formulations")